Clinical trial inclusion criterion:
Age > 18 years and < 90 years

Annotated entities:
- Person: "Age"
- Value: "> 18 years"
- Value: "< 90 years"